Clinical trial inclusion criterion:
Children aging between 3 and 6 years

Entity relations:
- Has_value("aging", "between 3 and 6 years")